Clinical trial exclusion criterion:
older than 80 years

Annotated entities:
- Person: "years"
- Value: "older than 80"